Clinical trial inclusion criterion:
B. Non-castrate metastatic: Patients must present with radiographic evidence of metastatic disease at the time of diagnosis or after treatment for localized disease. These patients must show newly detected disease or progressing disease in bone or in soft tissue. Biochemical progression is defined as: minimum no. of determinations: 3 Interval: >2 weeks Minimal Baseline PSA value (ng/ml): 2 Minimal % increase in range of values: 50%

Annotated entities:
- Qualifier: "Non-castrate"
- Qualifier: "metastatic"
- Observation: "radiographic evidence"
- Procedure: "radiographic"
- Condition: "metastatic disease"
- Temporal: "at the time of diagnosis"
- Temporal: "after treatment for localized disease"
- Procedure: "treatment"
- Condition: "localized disease"
- Reference_point: "treatment for localized disease"
- Reference_point: "the time of diagnosis"
- Temporal: "newly detected"
- Condition: "disease in bone"
- Condition: "progressing disease in soft tissue"
- Condition: "disease in soft tissue"
- Condition: "progressing disease in bone"
- Observation: "Biochemical progression"
- Measurement: "Minimal % increase in range of values"
- Value: "50%"
- Measurement: "Minimal Baseline PSA value"
- Value: "(ng/ml): 2"
- Measurement: "minimum no. of determinations"
- Value: "3"
- Measurement: "Interval"
- Value: ">2 weeks"